Clinical trial exclusion criterion:
Patients with a body mass index (BMI) > 40

Entity relations:
- Subsumes("body mass index", "BMI")
- Has_value("body mass index", "> 40")